依據肌肉之血管解剖（vascular anatomy）分類，下列肌肉何者非第四類血管支配（type IV vascular pattern）？
A. 長腳趾伸肌（extensor digitorum longus；EDL）
B. 長大腳趾伸肌（extensor hallucis longus；EHL）
C. 股薄肌（gracilis）
D. 前脛肌（tibialis anterior）

正確答案：C. 股薄肌（gracilis）